Completion of the screening process within 28 days prior to dosing

The above is a clinical trial inclusion criterion. Annotated with entity spans:
Completion of the [Procedure: screening process] [Temporal: within 28 days prior to dosing]